Clinical trial exclusion criterion:
Patients requiring surgery for neoplastic processes

Annotated entities:
- Procedure: "surgery"
- Condition: "neoplastic processes"